Clinical trial inclusion criterion:
palpable cord

Annotated entities:
- Condition: "palpable cord"